Clinical trial exclusion criterion:
history of multiple severe hypoglycemic episodes within the last two years

Annotated entities:
- Condition: "hypoglycemic episodes"
- Qualifier: "severe"
- Multiplier: "multiple"
- Temporal: "last two years"